治療急性高血鉀合併有心電圖高血鉀之變化時，為了避免高血鉀併發症，下列那一種方法效果最快發生？
A. 胰島素（insulin）加葡萄糖輸注
B. 離子交換劑（cation exchange resin）口服
C. 乙型（β2）交感神經促進劑（adrenergic agonists）噴霧使用
D. calcium gluconate 靜脈輸注

正確答案：D. calcium gluconate 靜脈輸注